Clinical trial exclusion criterion:
Has a history of not achieving comfortable CL wear (5 days per week; > 8 hours/day)

Annotated entities:
- Temporal: "history"
- Condition: "comfortable CL wear"
- Negation: "not"
- Temporal: "5 days per week"
- Temporal: "> 8 hours/day"